Clinical trial inclusion criterion:
Meets IR criteria and M3 marrow on day 15 (not SR and M3 on day 15)

Annotated entities:
- Line: "Meets IR criteria and M3 marrow on day 15 (not SR and M3 on day 15)"
- Measurement: "IR criteria"
- Value: "Meets"
- Condition: "M3 marrow"
- Temporal: "on day 15"
- Value: "not"
- Measurement: "SR"
- Condition: "M3"
- Temporal: "on day 15"